Clinical trial exclusion criterion:
A positive result for HLA-B*1301 in those subjects randomised to the genetic screening arm.

Entity relations:
- Has_value("HLA-B*1301", "positive")